Intra-Ocular Pressure (IOP) is under control (i.e., IOP ≤ 25 mm in the study eye) and study eye is not receiving any IOP lowering drops.

The above is a clinical trial inclusion criterion. Annotated with entity spans:
[Measurement: Intra-Ocular Pressure (IOP)] is [Value: under control] (i.e., [Measurement: IOP] [Value: ≤ 25 mm] [Qualifier: in the study eye]) and [Qualifier: study eye] is [Negation: not] receiving any [Drug: IOP lowering drops].